Clinical trial exclusion criterion:
Visual loss and/or serous detachment on OCT < 6 weeks;

Annotated entities:
- Condition: "Visual loss"
- Condition: "serous detachment"
- Procedure: "OCT"
- Temporal: "< 6 weeks"